于先生因嗜愛美食而食用浸酒毛蟹（醉蟹）多年，日前因不明原因發燒、咳嗽、胸痛及大量帶血絲濃痰 （blood-tinged sputum）而就醫，經醫院檢查發現痰液內有許多深褐色蟲卵及卡格里登結晶（CharcotLeyden crystals)，胸部X光顯示有斑狀浸潤及結節狀囊體陰影，並有胸膜積水（pleural effusion）及嗜酸性
 白血球增多（eosinophilia）現象。依據以上敘述，于先生最可能感染何種寄生蟲？
A. 異形吸蟲（Heterophyes heterophyes）
B. 日本血吸蟲（Schistosoma japonicum）
C. 薑片蟲（Fasciolopsis buski）
D. 衛氏肺吸蟲（Paragonimus westermani）

正確答案：D. 衛氏肺吸蟲（Paragonimus westermani）